Which ApoE isoform is associated with atherosclerosis and Alzheimer's disease?

The ApoE4 isoform is associated with increased frequency of atherosclerosis and Alzheimer's disease (AD).